Clinical trial exclusion criterion:
Drug-eluting stent implantation within 3 months prior to TAVI procedure;

Entity relations:
- multi("TAVI procedure", "TAVI procedure")
- AND("implantation", "Drug-eluting stent")
- Has_temporal("implantation", "within 3 months prior to TAVI procedure")
- Has_index("within 3 months prior to TAVI procedure", "TAVI procedure")